Clinical trial exclusion criterion:
Patients with a known congenital or acquired immunodeficiency.

Annotated entities:
- Condition: "immunodeficiency"
- Qualifier: "acquired"
- Qualifier: "congenital"